一位 40 歲女性門診主訴血尿，尿液檢查（U/A）結果如下：比重 1.000，尿潛血（OB）2+，紅血球 （RBC）0～1/HPF，白血球（WBC）1～2/HPF，尿蛋白（-）。理學檢查無異狀，下列何者為最佳處置？
A. 告訴病人沒有問題
B. 告訴病人檢驗結果可能偽陰性（false negative），請病人反覆再驗尿液
C. 告訴病人有血尿，需安排膀胱鏡檢查
D. 告訴病人有血尿，需進一步安排尿路攝影（IVP）

正確答案：B. 告訴病人檢驗結果可能偽陰性（false negative），請病人反覆再驗尿液